NOTE: If APRI and FIB-4 are discordant one of the other forms of fibrosis staging must be used.

The above is a clinical trial exclusion criterion. Annotated with entity spans:
[Non-representable: NOTE: If APRI and FIB-4 are discordant one of the other forms of fibrosis staging must be used.]